Clinical trial inclusion criterion:
Surgical patients 60 years of age or older

Annotated entities:
- Value: "60 years or older"
- Person: "age"